Which type of pluripotency is Otx2 associated with?

The transcription factor Otx2 acts as a negative switch in the regulation of transition from naive to primed pluripotency in mouse pluripotent stem cells.